Clinical trial inclusion criterion:
Audible abnormalities by chest examination compatible with pneumonia

Entity relations:
- Has_context("chest examination", "Audible abnormalities")
- AND("pneumonia", "chest examination")